Has a history of latent or active granulomatous infection prior to Screening

The above is a clinical trial exclusion criterion. Annotated with entity spans:
Has a history of [Qualifier: latent] or [Qualifier: active] [Condition: granulomatous infection] [Temporal: prior to Screening]